Clinical trial exclusion criterion:
History of penetrating head injury

Annotated entities:
- Condition: "penetrating head injury"